Clinical trial exclusion criterion:
Age <1m or > 24 months of age

Annotated entities:
- Person: "Age"
- Value: "<1m or > 24 months of age"